Which phase III clinical trials for rheumatoid arthritis involve baricitinib? (November 2017)

The phase 3 clinical trials of baricitinib in rheumatoid arthritis patients are: RA-BEACON, RA-BUILD, RA-BEAM.